Tras la reacción de algunos xenobióticos con el glutatión se forman como producto final:
1. Sulfanil urea.
2. Glutatión reducido.
3. Glutatión oxidado.
4. Tiosulfato.
5. Ácido mercaptúrico.

Respuesta correcta: 5. Ácido mercaptúrico.